Clinical trial inclusion criterion:
Normal serum TSH within 12 months preceding surgery

Annotated entities:
- Measurement: "serum TSH"
- Value: "Normal"
- Temporal: "within 12 months preceding surgery"
- Reference_point: "surgery"